Clinical trial inclusion criterion:
Non-traumatic LBP: no substantial and direct trauma to the back within the previous month

Entity relations:
- Has_qualifier("LBP", "Non-traumatic")
- Has_qualifier("trauma", "substantial")
- Has_qualifier("trauma", "back")
- Has_temporal("trauma", "within the previous month")
- Subsumes("LBP", "trauma")
- OR("substantial", "direct")